下列何種疾病可於頸靜脈波圖上，呈現巨大之 v 波？
A. 二尖瓣閉鎖不全
B. 二尖瓣狹窄
C. 三尖瓣狹窄
D. 三尖瓣閉鎖不全

正確答案：D. 三尖瓣閉鎖不全